inability to correct coagulopathy;

The above is a clinical trial exclusion criterion. Annotated with entity spans:
[Mood: inability to] [Procedure: correct] [Condition: coagulopathy];